Clinical trial inclusion criterion:
Couple must have been in a new relationship that started no more than six months prior to study entry

Entity relations:
- Has_temporal("new relationship", "no more than six months prior to study entry")